某酵素對受質A的動力學參數為：Km＝0.01 mM；Kcat＝5 S-1，而對受質B的動力學參數為：Km 1 mM；Kcat＝5 S-1，由以上數據可知：
A. 此酵素對受質 B 的反應速率較易飽和
B. 當催化速率處於飽和時，此酵素對受質 A 的反應較快
C. 此酵素對受質 A 的專一性較高
D. 當受質濃度極低時，此酵素對受質 B 的反應較快

正確答案：C. 此酵素對受質 A 的專一性較高